要診斷肺尖（lung apices）上的病灶，下列何種X光片的照法，最為適當？
A. PA view
B. lateral view
C. lateral decubitus view
D. lordotic view

正確答案：D. lordotic view